關於利用心臟超音波應用於評估急性 ST 節段上升型心肌梗塞（STEMI）病患，下列敘述何者錯誤？
A. 心室壁運動異常（ventricular wall motion abnormality）可用以區分急性 STEMI 與舊有之心肌疤痕
B. 估算左心室射出分率可作為病人預後之評估
C. 有助於發現右心室梗塞
D. 杜卜勒心臟超音波可用於偵測心室中隔缺損與二尖瓣返流等嚴重合併症

正確答案：A. 心室壁運動異常（ventricular wall motion abnormality）可用以區分急性 STEMI 與舊有之心肌疤痕